diagnosis of stage II adhesive capsulitis as determined by clinical examination of the treating physician, and

The above is a clinical trial inclusion criterion. Annotated with entity spans:
diagnosis of [Qualifier: stage II] [Condition: adhesive capsulitis] [Qualifier: as determined by clinical examination] of the treating physician, and